What is Heterochromia Iridis?

Heterochromia Iridis is a rare autosomal dominant disorder of melanocyte development characterized by heterochromatosis of the coronal, sagittal, and lambdoid sutures.